El Sr. X es un paciente de 67 años de edad al que se le ha prescrito atorvastatina por vía oral debido a los niveles altos de colesterol que no han mejorado tras medidas dietéticas. Entre las aplicaciones clínicas de los inhibidores de la HMG-CoA reductasa tenemos:
1. Son los fármacos de elección en el caso de mujer embarazada.
2. Son fármacos de primera elección en el tratamiento de las hipertrigliceridemias.
3. No son efectivas en la prevención secundaria del infarto de miocardio.
4. En dislipemias graves, caso de la hipercolesterolemia familiar heterocigótica, deben combinarse con ezetimiba.
5. No son efectivas en la prevención secundaria del accidente cerebrovascular.

Respuesta correcta: 4. En dislipemias graves, caso de la hipercolesterolemia familiar heterocigótica, deben combinarse con ezetimiba.